住院病人在使用抗生素治療感染症時，常有腹瀉情況，下列敘述何者錯誤？
A. pseudomembranous colitis 主要是由 Clostridium difficile 所引起
B. 糞便的病菌培養及病菌的毒素偵測可以用來診斷 pseudomembranous colitis
C. 大部分的病人在停用抗生素後，腹瀉的症狀就會緩解
D. 若腹瀉症狀持續，可以用針劑型的 Metronidazole 或 Vancomycin 來治療病人

正確答案：D. 若腹瀉症狀持續，可以用針劑型的 Metronidazole 或 Vancomycin 來治療病人